72 歲退休的洪老師發生突發性眩暈（vertigo）、步態不穩（ataxia）、吞嚥困難、右側肢體感覺喪失、左側眼瞼下垂合併瞳孔縮小但是沒有顏面神經麻痺，至急診室求診，最有可能是：
A. 額葉梗塞（Frontal lobe infarct）
B. 顳葉梗塞（Temporal lobe infarct）
C. 頂葉梗塞（Parietal lobe infarct）
D. 腦幹梗塞（Brainstem infarct）

正確答案：D. 腦幹梗塞（Brainstem infarct）